Temp >38,0 °C or <36,0 °C

The above is a clinical trial inclusion criterion. Annotated with entity spans:
[Measurement: Temp] [Value: >38,0 °C] or [Value: <36,0 °C]